What is Telangiectasia?

Telangiectasias are small focal red macules and papules created by abnormally prominent capillaries, venules, and arterioles